La respuesta inmunitaria innata frente a los virus está principalmente mediada por linfocitos:
1. B1.
2. Th1.
3. T citolíticos.
4. NK.
5. Tγδ.

Respuesta correcta: 4. NK.